Clinical trial exclusion criteria:
Patient has previously received or is receiving an organ transplant other than a liver.
Patient currently requires dialysis
Recipient or donor is known to be seropositive for human immunodeficiency virus (HIV)
Patient has received a liver transplant from a non-heart beating donor
Patient who is HCV negative has received an HCV positive (HCV RNA by PCR or HCV antibody) donor liver
Patient who is HbsAg negative has received an HbsAg positive (HBV DNA by PCR or HBV antibody) donor liver
Patient has received a liver transplant from a decrease donor > 70 years of age
Patient has a current malignancy or a history of malignancy (within the past 5 years), except hepatocellular carcinoma within UCSF Criteria and basal or non-metastatic squamous cell carcinoma of skin that has been treated successfully.
Patient is hemodynamically unstable on POD 15

Annotated entities:
- Procedure: "organ transplant"
- Negation: "other than"
- Qualifier: "liver"
- Procedure: "dialysis"
- Measurement: "human immunodeficiency virus"
- Value: "seropositive"
- Measurement: "HIV"
- Person: "Recipient"
- Person: "donor"
- Procedure: "liver transplant"
- Person: "donor"
- Qualifier: "heart beating"
- Negation: "non"
- Measurement: "HCV"
- Value: "negative"
- Qualifier: "liver"
- Measurement: "HCV"
- Value: "positive"
- Person: "donor"
- Measurement: "HCV RNA"
- Measurement: "HCV antibody"
- Measurement: "PCR"
- Measurement: "HbsAg"
- Value: "negative"
- Measurement: "HbsAg"
- Value: "positive"
- Measurement: "PCR"
- Measurement: "HBV DNA"
- Measurement: "HBV antibody"
- Person: "donor"
- Qualifier: "liver"
- Procedure: "liver transplant"
- Person: "donor"
- Value: "> 70 years"
- Person: "age"
- Condition: "malignancy"
- Condition: "history of malignancy"
- Temporal: "within the past 5 years"
- Condition: "hepatocellular carcinoma"
- Negation: "except"
- Measurement: "UCSF Criteria"
- Condition: "basal cell carcinoma of skin"
- Condition: "squamous cell carcinoma of skin"
- Qualifier: "non-metastatic"
- Mood: "treated successfully"
- Condition: "hemodynamically unstable"
- Measurement: "POD 15"